What percentage of C. elegans genes reside in operons?

Approximately 15% of the genes in C. elegans are located in operons, of which at least 15% are known to date.